Clinical trial exclusion criterion:
Children (<18 years old).

Annotated entities:
- Person: "Children"
- Value: "<18 years"
- Person: "old"